Clinical trial exclusion criterion:
Parasitic worm infection e.g. schistosomiasis, and hook worm by stool analysis.

Entity relations:
- Subsumes("Parasitic worm infection", "schistosomiasis")
- AND("stool analysis", "Parasitic worm infection")
- OR("schistosomiasis", "hook worm")